下列何者為對光敏感的感光色素成分？
A. retinal
B. transducin
C. phosphodiesterase
D. opsin

正確答案：A. retinal